Clinical trial exclusion criterion:
1) pregnancy, breast-feeding women, or female patients of childbearing potential but did not take contraceptive measures;2) existing severe acute infection and is not controlled; or purulent and chronic infection, delayed healing wounds; 3) the original severe heart disease, including congestive heart failure, uncontrolled high-risk arrhythmias, unstable angina, myocardial infarction, severe heart valve disease and resistant hypertension; 4) suffering from neurological and psychiatric diseases or mental disorders is not easy to control, poor compliance, and can not be described with treatment responders; primary brain or central nervous metastasis disease has not been controlled, with significant cranial hypertension or neuropsychiatric symptoms; 5) have bleeding tendencies; 6) other researchers believe that patients should not participate in the present trial.

Annotated entities:
- Line: "1) pregnancy, breast-feeding women, or female patients of childbearing potential but did not take contraceptive measures;"
- Line: "2) existing severe acute infection and is not controlled; or purulent and chronic infection, delayed healing wounds;"
- Line: "3) the original severe heart disease, including congestive heart failure, uncontrolled high-risk arrhythmias, unstable angina, myocardial infarction, severe heart valve disease and resistant hypertension;"
- Line: "4) suffering from neurological and psychiatric diseases or mental disorders is not easy to control, poor compliance, and can not be described with treatment responders; primary brain or central nervous metastasis disease has not been controlled, with significant cranial hypertension or neuropsychiatric symptoms;"
- Line: "5) have bleeding tendencies;"
- Line: "6) other researchers believe that patients should not participate in the present trial."
- Pregnancy_considerations: "pregnancy, breast-feeding women, or female patients of childbearing potential but did not take contraceptive measures;"
- Qualifier: "severe"
- Qualifier: "acute"
- Condition: "infection"
- Qualifier: "not controlled"
- Qualifier: "chronic"
- Qualifier: "purulent"
- Condition: "infection"
- Condition: "delayed healing wounds"
- Qualifier: "severe"
- Condition: "heart disease"
- Condition: "congestive heart failure"
- Qualifier: "uncontrolled"
- Qualifier: "high-risk"
- Condition: "arrhythmias"
- Condition: "unstable angina"
- Condition: "myocardial infarction"
- Qualifier: "severe"
- Condition: "heart valve disease"
- Qualifier: "resistant"
- Condition: "hypertension"
- Condition: "psychiatric diseases"
- Condition: "neurological diseases"
- Condition: "mental disorders"
- Condition: "poor compliance"
- Condition: "central nervous metastasis disease"
- Condition: "primary brain disease"
- Negation: "not"
- Qualifier: "controlled"
- Qualifier: "significant"
- Condition: "cranial hypertension"
- Condition: "neuropsychiatric symptoms"
- Condition: "bleeding tendencies"
- Non-query-able: "other researchers believe that patients should not participate in the present trial."